以免疫組織化學染色法檢查發現某一轉移性癌症之細胞為 Cytokeratin 20 陰性，Cytokeratin 7 陽性
A. 大腸癌
B. 胰臟癌
C. 膀胱移型上皮癌
D. 肺癌

正確答案：D. 肺癌